Clinical trial inclusion criteria:
Response assessment of complete response (CR), partial response (PR), long stable disease (SD) for >3 months with a cancer immunotherapy treatment for metastatic cancer or hematologic malignancies either through a marketed CPI or through participation in a Roche/Genentech CPI clinical trial.
Availability of tumor biopsy material extracted and preserved by the investigating site.

Annotated entities:
- Measurement: "Response assessment"
- Value: "complete response (CR)"
- Value: "partial response (PR)"
- Value: "long stable disease (SD)"
- Temporal: "for >3 months"
- Qualifier: "cancer"
- Procedure: "immunotherapy treatment"
- Condition: "metastatic cancer"
- Condition: "hematologic malignancies"
- Procedure: "marketed CPI"
- Observation: "participation in a Roche/Genentech CPI clinical trial"
- Non-representable: "Availability of tumor biopsy material extracted and preserved by the investigating site"